What histone modification is recognized by the bromodomain?

Acetylated lysines in histones (generally H3 and H4)